La existencia de hipertrofia congénita del epitelio pigmentario de la retina es típica en los pacientes con:
1. Poliposis adenomatosa familiar.
2. Síndrome de Peutz-Jeghers.
3. Síndrome de Cronkhite-Canada.
4. Síndrome de Cowden.

Respuesta correcta: 1. Poliposis adenomatosa familiar.